Clinical trial exclusion criterion:
Severe cardiac disease, including New York Heart Association Class III or IV congestive heart failure, clinically significant aortic stenosis, history of cardiac arrest, use of a cardiac defibrillator, or uncontrolled angina

Annotated entities:
- Condition: "cardiac disease"
- Qualifier: "Severe"
- Measurement: "New York Heart Association"
- Value: "Class III or IV"
- Condition: "congestive heart failure"
- Qualifier: "clinically significant"
- Condition: "aortic stenosis"
- Temporal: "history"
- Condition: "cardiac arrest"
- Device: "cardiac defibrillator"
- Condition: "uncontrolled angina"
- Qualifier: "New York Heart Association Class III or IV"